Clinical trial exclusion criterion:
uncontrolled depression

Annotated entities:
- Condition: "depression"
- Qualifier: "uncontrolled"